Intake of disallowed medications including(but not limited to):

The above is a clinical trial exclusion criterion. Annotated with entity spans:
[Parsing_Error: Intake of disallowed medications including(but not limited to):]